Clinical trial exclusion criterion:
Need for premedication

Entity relations:
- Has_mood("premedication", "Need for")